下列何者構成會陰膜（perineal membrane）？
A. 骨盆橫膈（Pelvic diaphragm）
B. 會陰淺筋膜（Perineal superficial fascia）
C. 會陰深筋膜上層（Superior perineal deep fascia）
D. 會陰深筋膜下層（Inferior perineal deep fascia）

正確答案：D. 會陰深筋膜下層（Inferior perineal deep fascia）